一位 8 歲兒童已完成所有規定之預防注射，在家裡手被菜刀割傷時，應該給予何種破傷風處置？
A. T.T.（Tetanus toxoid）
B. T.I.G.（Tetanus immune globulin）
C. T.T.和 T.I.G.皆需要
D. T.T.和 T.I.G.皆不需要

正確答案：D. T.T.和 T.I.G.皆不需要